急性發炎時，血管通透性改變的最主要原因是：
A. 血管內皮細胞收縮
B. 血管內靜水壓增高
C. 血管內靜水壓下降
D. 血流停滯

正確答案：A. 血管內皮細胞收縮